¿Cómo se llama el tipo de estructura de una organización, en el que cada persona ya no depende exclusivamente de un solo jefe, sino que además puede estar afectada por proyectos y estatutos diferentes, durante un tiempo variable o fijo?:
1. Piramidal.
2. Divisional.
3. Matricial.
4. Organigrama de Urwick.
5. Funcional.

Respuesta correcta: 3. Matricial.